Es una enfermedad producida por mutaciones del ADN mitocondrial:
1. Neuropatía óptica hereditaria.
2. Síndrome de Goltz.
3. Síndrome de Hunter.
4. Neurofibromatosis.

Respuesta correcta: 1. Neuropatía óptica hereditaria.